Clinical trial exclusion criterion:
Doubtful compliance or unable to afford full course of therapy

Entity relations:
- OR("Doubtful compliance", "unable to afford full course of therapy")